影響吸入性麻醉氣體吸收（uptake）的因素，下列何者錯誤？
A. 病患的功能肺餘量（functional residual capacity）
B. 麻醉氣體在血中的溶解度（solubility）
C. 流經肺泡的血流量
D. 肺泡與靜脈血中的麻醉氣體分壓差

正確答案：A. 病患的功能肺餘量（functional residual capacity）